排尿膀胱尿道造影檢查（voiding cystourethrography）發現病人有一側顯影劑由膀胱逆流至輸尿管和腎盂，並且有輕微的腎盂擴張，這種膀胱輸尿管尿液逆流為第幾度？
A. 1
B. 2
C. 3
D. 4

正確答案：C. 3